Dentro de las distorsiones perceptivas podemos encontrar:
1. Las alucinaciones.
2. Las metamorfopsias.
3. Las imágenes eidéticas.
4. La autoscopia (o fenómenos del doble).
5. Las imágenes parásitas.

Respuesta correcta: 2. Las metamorfopsias.